Clinical trial exclusion criteria:
Hemodynamically unstable in need of acute treatment
Most recent hCG > 5000 mIU/mL
Patient obtaining care in relation to a recently completed pregnancy (delivery, spontaneous or elective abortion)
Diagnosis of gestational trophoblastic disease
Subject unwilling or unable to comply with study procedures
Known hypersensitivity to MTX
Presence of clinical contraindications for treatment with MTX
Prior medical or surgical management of this gestation
Subject unwilling to accept a blood transfusion

Annotated entities:
- Condition: "Hemodynamically unstable"
- Measurement: "hCG"
- Temporal: "Most recent"
- Value: "> 5000 mIU/mL"
- Non-query-able: "Patient obtaining care in relation to a recently completed pregnancy (delivery, spontaneous or elective abortion)"
- Condition: "gestational trophoblastic disease"
- Non-query-able: "Subject unwilling or unable to comply with study procedures"
- Condition: "hypersensitivity to MTX"
- Drug: "MTX"
- Undefined_semantics: "Presence of clinical contraindications for treatment with MTX"
- Procedure: "medical management"
- Procedure: "surgical management"
- Condition: "gestation"
- Non-query-able: "Subject unwilling to accept a blood transfusion"
- Post-eligibility: "Subject unwilling to accept a blood transfusion"